1. Fasting glucose > 7.0 or have diabetes medication;

The above is a clinical trial inclusion criterion. Annotated with entity spans:
1. [Measurement: Fasting glucose] [Value: > 7.0] or have [Drug: diabetes medication];